Clinical trial exclusion criterion:
Left main disease

Annotated entities:
- Condition: "Left main disease"